Clinical trial exclusion criterion:
Investigational product use in the last 6 months

Entity relations:
- Has_temporal("Investigational product use", "in the last 6 months")